Clinical trial inclusion criterion:
2. Interest in participating in a novel nutritional supplement program.

Annotated entities:
- Post-eligibility: "Interest in participating in a novel nutritional supplement program."